Clinical trial exclusion criterion:
Participation in the 4 weeks preceding inclusion or planned participation during the present trial period in another clinical trial investigating a vaccine, drug, medical device, or medical procedure.

Annotated entities:
- Temporal: "4 weeks preceding inclusion"
- Reference_point: "inclusion"
- Mood: "planned participation"
- Context_Error: "Participation in the 4 weeks preceding inclusion or planned participation during the present trial period in another clinical trial investigating a vaccine, drug, medical device, or medical procedure."
- Post-eligibility: "Participation in the 4 weeks preceding inclusion or planned participation during the present trial period in another clinical trial investigating a vaccine, drug, medical device, or medical procedure."